Clinical trial exclusion criterion:
For CTCL: (TSEBT) within 12 weeks, or initiation of topical steroid, nitrogen mustard, or topical retinoid within 2 weeks. (Stable topical ≥ 4 weeks prior to Day 1 allowed).

Annotated entities:
- Condition: "CTCL"
- Procedure: "TSEBT"
- Temporal: "within 12 weeks"
- Drug: "topical steroid"
- Observation: "initiation"
- Drug: "nitrogen mustard"
- Drug: "topical retinoid"
- Temporal: "within 2 weeks"
- Temporal: "≥ 4 weeks prior to Day 1"
- Reference_point: "Day 1"
- Grammar_Error: "allowed"